11. Uncontrolled diabetes with recent weight loss, diabetic coma, or frequent insulin reactions;

The above is a clinical trial exclusion criterion. Annotated with entity spans:
[Parsing_Error: 11.] [Qualifier: Uncontrolled] [Condition: diabetes] with recent [Condition: weight loss], [Condition: diabetic coma], or [Multiplier: frequent] [Condition: insulin reactions];